Which two catechol-O-methyl transferase (COMT) inhibitors can be used for treatment of Parkinson disease?

Tolcapone (central and peripheral) and entacapone (peripheral) are catechol-O-methyl transferase inhibitors that are used for treatment of Parkinson disease.